Clinical trial exclusion criterion:
Severe visual impairment, which would preclude completion of the assessments and/or intervention

Entity relations:
- Has_qualifier("visual impairment", "Severe")